Clinical trial exclusion criterion:
Use of any vaccine type within 30 days before the vaccination of the study;

Entity relations:
- Has_index("within 30 days before the vaccination of the study", "the vaccination of the study")
- Has_temporal("any vaccine type", "within 30 days before the vaccination of the study")